Clinical trial inclusion criterion:
4. MMSE score ≥ 20

Entity relations:
- Has_value("MMSE", "score ≥ 20")